5. Ability to ambulate with or without assistive devices

The above is a clinical trial inclusion criterion. Annotated with entity spans:
[Parsing_Error: 5.] [Condition: Ability to ambulate with] or without assistive devices